一位 63 歲男性最近體重減輕 15 公斤，他有糖尿病史 20 年，理學檢查發現舌頭上有裂紋（fissured tongue）及對振動之感覺喪失。血液檢查發現血紅素 10.1 g/dL 且平均血球容積為 124 fL。下列何診 斷最有可能？
A. 酒精中毒（alcoholism）
B. 甲狀腺功能過低（hypothyroidism）
C. 糜爛性胃炎（erosive gastritis）
D. 惡性貧血（pernicious anemia）

正確答案：D. 惡性貧血（pernicious anemia）